僵直性脊椎炎（ankylosing spondylitis）是常見的青少年下背僵硬疼痛的疾病，病患初次就診時若從家族史問出有同一診斷的近親時，則病患本身很有可能帶有何種與僵直性脊椎炎相關性強的人類白血球抗原（HLA）？
A. HLA-B5
B. HLA-B27
C. HLA-DR2
D. l HLA-DR4

正確答案：B. HLA-B27